Previous incontinence surgery

The above is a clinical trial exclusion criterion. Annotated with entity spans:
Previous [Procedure: incontinence surgery]